下列何種絛蟲，其成蟲蟲體長度小於 1 公分：
A. 縮小包膜絛蟲
B. 短小包膜絛蟲
C. 包生絛蟲
D. 犬複殖器絛蟲

正確答案：C. 包生絛蟲